Clinical trial exclusion criterion:
Heart rate <60 beats/min

Entity relations:
- Has_value("Heart rate", "<60 beats/min")